Clinical trial exclusion criterion:
pregnant or breast feeding females

Entity relations:
- OR("pregnant", "breast feeding")